Clinical trial inclusion criterion:
with multiple sclerosis according to the criteria of Mac Donald 2010 : relapsing-remitting (RR), secondary-progressive (SP) or primary-progressive (PP)

Annotated entities:
- Condition: "multiple sclerosis"
- Measurement: "criteria of Mac Donald 2010"
- Qualifier: "relapsing-remitting"
- Qualifier: "RR"
- Qualifier: "secondary-progressive"
- Qualifier: "SP"
- Qualifier: "primary-progressive"
- Qualifier: "PP"